Lambda噬菌體DNA是藉由何種作用嵌入大腸桿菌的基因體DNA中？
A. 同源重組（homologous recombination）
B. 轉位作用（transposition）
C. 特定點重組（site-specific recombination）
D. 非同源性末端接合（non-homologous end joining, NHEJ）

正確答案：C. 特定點重組（site-specific recombination）